Clinical trial exclusion criterion:
has a history of taste or smell loss or other oral disorders (e.g., burning mouth syndrome)

Annotated entities:
- Temporal: "history"
- Condition: "smell loss"
- Condition: "taste loss"
- Qualifier: "other"
- Condition: "oral disorders"
- Condition: "burning mouth syndrome"